Prisoners.

The above is a clinical trial exclusion criterion. Annotated with entity spans:
[Person: Prisoners].